下列何種抗生素，可抑制細菌合成葉酸過程中所需酵素dihydrofolate reductase，故可和sulfonamides併用產生協同作用？
A. tazobactam
B. teicoplanin
C. tobramycin
D. trimethoprim

正確答案：D. trimethoprim